對一個無乳癌家族或個人史的女性，下列何種乳癌篩選，比較符合美國、加拿大及歐洲的相關建議？
A. 自50歲起每2年做一次核磁共振檢查（MRI）
B. 自40歲起每2年做一次乳房超音波（sonography）
C. 自50歲起每2年做一次乳房攝影（mammography）
D. 自35歲起每2年做正子攝影檢查（PET）

正確答案：C. 自50歲起每2年做一次乳房攝影（mammography）